Una gestante de 31 semanas acude a Urgencias refiriendo pérdida de líquido por vagina. La exploración con espéculo objetiva salida de líquido claro por el orificio cervical externo. Está apirética. El registro cardiotocográfico no revela contracciones y la frecuencia cardiaca fetal es normal. La exploración ecográfica no revela malformaciones y el cuello uterino no está acortado. ¿Qué combinación terapéutica indicaría?
1. Tocolíticos, corticoides y antibióticos.
2. Tocolíticos y antibióticos.
3. Tocolíticos y corticoides.
4. Oxitocina, corticoides y antibióticos.
5. Corticoides y antibióticos.

Respuesta correcta: 5. Corticoides y antibióticos.